下列何者不是創傷後壓力疾患（posttraumatic stress disorder, PTSD）的診斷標準？
A. 重複經驗，例如相似創傷情境的惡夢
B. 逃避相關情境的刺激
C. 失眠
D. 憂鬱

正確答案：D. 憂鬱